Clinical trial exclusion criterion:
Planned administration of a vaccine not foreseen by the study protocol up to 30 days after the second vaccination with H5N1 vaccine.

Entity relations:
- Has_qualifier("vaccine", "foreseen by the study protocol")
- AND("second", "vaccination")
- AND("vaccination", "H5N1 vaccine")
- Has_value("up to 30 days", "second")
- Has_temporal("vaccine", "up to 30 days")
- OR("not", "foreseen by the study protocol")